Participants currently receiving any type of anticoagulation or blood thinning medications, including heparin, low molecular weight heparins, Plavix, aspirin, NSAIDS

The above is a clinical trial exclusion criterion. Annotated with entity spans:
Participants currently receiving any type of [Drug: anticoagulation] or [Drug: blood thinning medications], including [Drug: heparin], [Drug: low molecular weight heparins], [Drug: Plavix], [Drug: aspirin], [Drug: NSAIDS]